有關呼吸系統之組織發生病變，下列敘述何者錯誤？
A. 囊腫性纖維化（cystic fibrosis）是一種好發於小孩與年輕人的遺傳性、慢性阻塞呼吸疾病
B. 肺泡巨噬細胞（alveolar macrophage）可吞噬並分解結核桿菌（Mycobacterium tuberculosis）
C. 終末支氣管（terminal bronchiole）之後的空氣間隙呈永久性擴張（permanent enlargement）會導致肺氣腫
D. 慢性支氣管炎（chronic bronchitis）或支氣管擴張（bronchiectasis）時，部分呼吸上皮會轉化為複層扁平上皮（stratified squamous epithelium）

正確答案：B. 肺泡巨噬細胞（alveolar macrophage）可吞噬並分解結核桿菌（Mycobacterium tuberculosis）